Consecutive 30 female patients presenting to our clinic for brow lifting with botulinum toxin will be randomized to receive one of the two injection techniques

The above is a clinical trial inclusion criterion. Annotated with entity spans:
Consecutive [Multiplier: 30] [Person: female] patients presenting to our clinic for [Procedure: brow lifting] with [Drug: botulinum toxin] will be randomized to receive one of the two injection techniques